有關老年人自殺之敘述何者錯誤？
A. 憂鬱症為最常見的共病精神疾患
B. 老年人自殺較少採用激烈的手段
C. 自殺死亡者，男性多於女性
D. 常常因為失落或身體疾病誘發自殺行為

正確答案：B. 老年人自殺較少採用激烈的手段